Bishop-Score = 6

The above is a clinical trial inclusion criterion. Annotated with entity spans:
[Measurement: Bishop-Score] [Value: = 6]